Clinical trial exclusion criterion:
Concurrent anti-inflammatory therapy, including corticosteroid therapy

Annotated entities:
- Temporal: "Concurrent"
- Procedure: "anti-inflammatory therapy"
- Drug: "anti-inflammatory"
- Procedure: "corticosteroid therapy"
- Drug: "corticosteroid"